List pore forming toxins.

cytolysin A
α-hemolysin
Streptolysin O
pneumolysin
listeriolysin
leukocidin
Glabralysin